Clinical trial inclusion criteria:
Having been diagnosed with primary OCD as defined by the Diagnostic and Statistical Manual of Mental Disorders (DSM-IV-) criteria;Cleaning or checking as primary OCD symptoms
Yale-Brown Obsessive-Compulsive Scale (Y-BOCS) score of = 16
Never receiving adequate treatment or stop receiving treatment for at least 8 weeks
Having an education degree of high school or above
Accepting to participate in the study

Annotated entities:
- Condition: "primary OCD"
- Measurement: "DSM-IV"
- Measurement: "Diagnostic and Statistical Manual of Mental Disorders"
- Measurement: "Yale-Brown Obsessive-Compulsive Scale"
- Measurement: "Y-BOCS"
- Value: "score of = 16"
- Negation: "Never"
- Procedure: "treatment"
- Qualifier: "adequate"
- Negation: "stop"
- Procedure: "treatment"
- Temporal: "for at least 8 weeks"
- Person: "degree of high school"
- Post-eligibility: "ccepting to participate in the study"